El detector de conductividad térmica fue uno de los primeros usados en cromatografía de gases y todavía tiene mucha aplicación. Consiste en:
1. Una fuente que se calienta mediante electricidad, cuya temperatura a una energía eléctrica constante depende de la conductividad térmica del gas que lo rodea.
2. Una superficie metálica sobre la que colisionan iones, produciendo emisión de electrones u otros iones, con la consiguiente variación en la conductividad.
3. Una llama de aire/hidrógeno donde se pirolizan compuestos orgánicos produciendo iones que dan lugar a un cambio de conductividad.
4. Un emisor de radiación beta que permite la medida de la conductividad del eluyente que sale de la columna cromatográfica.
5. Una fuente de ionización térmica que produce iones positivos y negativos que cambian la conductividad del gas que pasa por el detector.

Respuesta correcta: 1. Una fuente que se calienta mediante electricidad, cuya temperatura a una energía eléctrica constante depende de la conductividad térmica del gas que lo rodea.